Adriana de 16 años lleva un tiempo siendo atendida por usted por presentar bajo nivel de confianza en sí misma. Ella muestra habitualmente risa hostil en consulta, hipersensibilidad a las críticas y racionalización de los fracasos. Además reconoce su dificultad en establecer relaciones y la tendencia a ridiculizar a sus compañeros. De entre los siguientes diagnósticos de enfermería, según NANDA Internacional, cuál presenta:
1. Afrontamiento ineficaz.
2. Afrontamiento defensivo.
3. Baja autoestima situacional.
4. Negación ineficaz.

Respuesta correcta: 2. Afrontamiento defensivo.